History of Guillain-Barré syndrome

The above is a clinical trial exclusion criterion. Annotated with entity spans:
History of [Condition: Guillain-Barré syndrome]